9. Prior participation in this study.

The above is a clinical trial exclusion criterion. Annotated with entity spans:
9. [Context_Error: Prior participation in this study.]